Which histone mark distinguishes active from inactive enhancers?

Conversion of inactive enhancers to an active state is marked by accumulation of H3K4me1 and H3K27ac histone marks.